Subject has been diagnosed with symptomatic paroxysmal atrial fibrillation as defined above and at least two symptomatic episodes in the last six months prior to inclusion.

The above is a clinical trial inclusion criterion. Annotated with entity spans:
Subject has been diagnosed with [Qualifier: symptomatic] [Condition: paroxysmal atrial fibrillation] as defined above and [Multiplier: at least two] [Qualifier: symptomatic] [Condition: episodes] in the [Temporal: last six months prior to inclusion].